Clinical trial exclusion criterion:
Women with ongoing pregnancy or who are breast feeding.

Annotated entities:
- Person: "Women"
- Condition: "pregnancy"
- Temporal: "ongoing"
- Observation: "breast feeding"